Clinical trial exclusion criterion:
9. Living or planned travel outside Montreal (> 1h of driving) area during closed-loop procedures.

Entity relations:
- Has_index("during closed-loop procedures", "closed-loop procedures")